Singleton gestation .scheduled for ECV desiring CSE.

The above is a clinical trial inclusion criterion. Annotated with entity spans:
[Condition: Singleton gestation] .[Mood: scheduled for] [Procedure: ECV] [Mood: desiring] [Procedure: CSE].